Clinical trial inclusion criterion:
3. Pulmonary vascular resistance (PVR) ≥300 dyn•s/cm5 (3.75 Wood units)

Entity relations:
- Subsumes("≥300 dyn•s/cm5", "3.75 Wood units")
- Has_value("Pulmonary vascular resistance (PVR)", "≥300 dyn•s/cm5")